下列關於cephalosporin用於治療細菌感染之敘述，何者正確？
A. 第一代cephalosporin可治療沙門氏桿菌（Salmonella）感染
B. 第二代cephalosporin可治療腸球菌（Enterococcus）感染
C. 第三代cephalosporin可治療克雷白氏桿菌（Klebsiella）腦膜炎
D. 第三代cephalosporin可治療李斯德菌（Listeria）腦膜炎

正確答案：C. 第三代cephalosporin可治療克雷白氏桿菌（Klebsiella）腦膜炎